一位媽媽在門診抱怨騎機車等紅燈時，會因拇指、食指、中指麻木而必須甩手，晚上睡覺時也會麻到醒來施予按摩，下列敘述何者正確？
A. 嚴重時會造成拇對掌肌（opponens pollicis）肌肉萎縮
B. 掌側屈腕（volar flexion of the wrist）往往會改善症狀
C. 頸椎椎間盤突出是主因
D. 一定要及早手術治療

正確答案：A. 嚴重時會造成拇對掌肌（opponens pollicis）肌肉萎縮